Clinical trial exclusion criterion:
Ejection fraction <35%

Entity relations:
- Has_value("Ejection fraction", "<35%")